congestive heart failure NYHA III-IV

The above is a clinical trial exclusion criterion. Annotated with entity spans:
[Condition: congestive heart failure] [Measurement: NYHA] [Value: III-IV]